Patients must be more than 18 years of age and referred for coronary angiography

The above is a clinical trial inclusion criterion. Annotated with entity spans:
Patients must be [Value: more than 18 years] of [Person: age] and [Mood: referred for] [Procedure: coronary angiography]